Which computational methods are used for the definition of synteny?

Computational methods used for the definition of synteny include multisyn, poff, orthocluster, phyldiag, synblast, cinteny, domainmanagement, domainweekly, domainScanx, run orthocluster, orthClusterdb and view synteny.